Clinical trial exclusion criterion:
history of uveitis

Annotated entities:
- Condition: "uveitis"
- Temporal: "history"